Clinical trial exclusion criterion:
pregnancy or nursing mothers

Annotated entities:
- Condition: "pregnancy"
- Condition: "nursing"